Subject or subject's medical decision maker agrees to participate in this study and provides informed consent

The above is a clinical trial inclusion criterion. Annotated with entity spans:
[Informed_consent: Subject or subject's medical decision maker agrees to participate in this study and provides informed consent]